Clinical trial exclusion criterion:
Pregnancy or breast-feeding.

Annotated entities:
- Pregnancy_considerations: "Pregnancy or breast-feeding"